Evidence of an active or suspected cancer or a history of malignancy where the risk of recurrence is >=20% within 2 years. Patients with a lesion suspicious of hepatic malignancy on a screening imaging study will only be eligible if the likelihood of carcinoma is <=10% following an appropriate evaluation.

The above is a clinical trial exclusion criterion. Annotated with entity spans:
Evidence of an [Temporal: active] or [Mood: suspected] [Condition: cancer] or a history of [Condition: malignancy] where the [Measurement: risk of recurrence] is [Value: >=20% within 2 years]. Patients with a [Condition: lesion] [Mood: suspicious] of [Condition: hepatic malignancy] on a [Procedure: screening imaging study] will only be eligible if the [Measurement: likelihood of carcinoma] is [Value: <=10%] following an appropriate evaluation.